Clinical trial inclusion criterion:
All patients within adult ICUs are included, including rare patients <18 years and >=12 years.

Annotated entities:
- Visit: "adult ICUs"
- Person: "adult"
- Person: "rare patients"
- Value: "<18 years and >=12 years"
- Person: "year"